La expresión del operón lac requiere:
1. Glucosa y GMPc.
2. Alolactosa y GMPc.
3. Glucosa y AMPc.
4. Lactosa y AMPc.

Respuesta correcta: 4. Lactosa y AMPc.